Clinical trial inclusion criterion:
BUN = 50mg/dl

Entity relations:
- Has_value("BUN", "= 50mg/dl")